Clinical trial inclusion criterion:
Post-procedural thrombolysis in myocardial infarction (TIMI) grade 3 flow in treated vessels

Annotated entities:
- Condition: "Post-procedural thrombolysis"
- Condition: "myocardial infarction"
- Measurement: "myocardial infarction grade"
- Value: "3"
- Qualifier: "treated vessels"
- Measurement: "TIMI"